What eye disease(s) are associated with ocular toxoplasmosis?

A large percentage of posterior and infectious uveitis is associate with toxoplasmosis. Retinochoroiditis is associated with congenital toxoplasmosis.